腎病症候群（Nephrotic Syndrome）和下列何種癌症最有關聯？
A. 腎臟細胞癌
B. 何杰金氏淋巴癌
C. 大腸癌
D. 肺癌

正確答案：B. 何杰金氏淋巴癌